Clinical trial inclusion criterion:
second trimester abortion

Entity relations:
- Has_qualifier("abortion", "second trimester")